Clinical trial inclusion criterion:
Patients with a histologically, radiologically or haematologically confirmed malignancy whose pain is judged by the investigator to be caused by the malignancy

Annotated entities:
- Procedure: "histologically"
- Procedure: "radiologically"
- Procedure: "haematologically"
- Value: "confirmed"
- Condition: "malignancy"
- Condition: "pain"